Clinical trial exclusion criterion:
History of depression.

Entity relations:
- Has_temporal("depression", "History of")